下列有關脫氫異雄固酮（dehydroepiandrosterone, DHEA）的敘述，何者錯誤？
A. 是腎上腺製造雄性素（androgen）的先驅物質
B. 黃體刺激素（luteinizing hormone）是調控腎上腺製造DHEA的主要激素
C. 不管男性或女性都在其20歲左右會逐漸達到分泌高峰期
D. 在女性，DHEA過度分泌與腎上腺性徵異常症候群有關（adrenogenital syndrome）

正確答案：B. 黃體刺激素（luteinizing hormone）是調控腎上腺製造DHEA的主要激素